free ammonia 在細胞內可藉由那一個酵素作用，將其轉化為無毒性的 L-glutamine？
A. glutaminase
B. glutamine synthetase
C. glutamate dehydrogenase
D. aspartate aminotransferase

正確答案：B. glutamine synthetase